當某些血管內皮受損時，下列何者可直接和血管平滑肌細胞作用，造成血管收縮？
A. Adenosine
B. Acetylcholine
C. ANP
D. Carbon monoxide（CO）

正確答案：B. Acetylcholine